Clinical trial exclusion criterion:
For the RECAMP-MV trial: the child is enrolled in RECAMP-OPV

Annotated entities:
- Observation: "RECAMP-MV trial"
- Observation: "enrolled in RECAMP-OPV"